Radiopaque material implanted in the chest wall (metal, silicone, etc.)

The above is a clinical trial exclusion criterion. Annotated with entity spans:
[Device: Radiopaque material] implanted in the [Qualifier: chest wall] (metal, silicone, etc.)